Clinical trial exclusion criterion:
Tobacco use within 3 months of enrollment and throughout first 6 months of the study

Annotated entities:
- Condition: "Tobacco use"
- Temporal: "within 3 months of enrollment"
- Reference_point: "enrollment"
- Temporal: "throughout first 6 months of the study"
- Reference_point: "the study"